Clinical trial inclusion criterion:
smoking at least 10 cigarettes per day

Entity relations:
- Has_multiplier("smoking", "at least 10 cigarettes per day")